Clinical trial exclusion criterion:
Active coagulation disorder not controlled with medication

Annotated entities:
- Condition: "coagulation disorder"
- Temporal: "Active"
- Qualifier: "controlled with medication"
- Negation: "not"